English speaking ability.

The above is a clinical trial inclusion criterion. Annotated with entity spans:
[Observation: English speaking ability].